Clinical trial exclusion criterion:
History of deep venous insufficiency, chronic venous leg ulcer or stasis dermatitis

Entity relations:
- Has_temporal("deep venous insufficiency", "History")
- OR("deep venous insufficiency", "stasis dermatitis", "chronic venous leg ulcer")